Decompensated cirrhosis defined by the presence of actual or previous history of clinical decompensation including ascites, hepatic encephalopathy, variceal bleeding or spontaneous bacterial peritonitis, or a Child-Pugh B or C.

The above is a clinical trial exclusion criterion. Annotated with entity spans:
[Qualifier: Decompensated] [Condition: cirrhosis] defined by the presence of [Temporal: actual] or [Temporal: previous] history of [Condition: clinical decompensation] including [Condition: ascites], [Condition: hepatic encephalopathy], [Condition: variceal bleeding] or [Condition: spontaneous bacterial peritonitis], or a [Measurement: Child-Pugh] [Value: B or C].